下列關於脂肪組織（adipose tissue）的敘述，何者正確？
A. 白色脂肪組織（white adipose tissue）主要是產生熱能，棕色脂肪組織（brown adipose tissue）主要是儲存能量
B. 脂肪細胞中的脂肪小滴（lipid droplet）是由漿膜（plasma membrane）包裹起來
C. 白色脂肪細胞（white adipocyte）中有很多小顆的脂肪小滴（lipid droplet），而棕色脂肪細胞內的則為一
D. 棕色脂肪組織（brown adipose tissue）在新生兒含量多且分布廣，隨著成⻑會逐漸減少

正確答案：D. 棕色脂肪組織（brown adipose tissue）在新生兒含量多且分布廣，隨著成⻑會逐漸減少